Clinical trial inclusion criterion:
Age 10-55 years

Annotated entities:
- Value: "10-55 years"
- Person: "Age"